下列何者腎小管酸中毒症（renal tubular acidosis）會併發腎結石？
A. Type I
B. Type II
C. Type III
D. Type IV

正確答案：A. Type I